Clinical trial inclusion criterion:
Evidence or suspicion of upper gastrointestinal bleed (GIB)

Entity relations:
- Has_mood("upper gastrointestinal bleed (GIB)", "Evidence")
- OR("Evidence", "suspicion")